下列何種疾病，最少合併膽囊水腫（Hydrops of gallbladder）？
A. 川崎症（Kawasaki disease）
B. 多脾症（Polysplenia syndrome）
C. 鏈球菌咽喉炎（Streptococcal pharyngitis）
D. 過敏性紫斑症（Henoch-Schönlein purpura）

正確答案：B. 多脾症（Polysplenia syndrome）